Documented thromboembolic event (including TIA) within the past 12 months (365 days)

The above is a clinical trial exclusion criterion. Annotated with entity spans:
Documented [Condition: thromboembolic event] (including [Condition: TIA]) [Temporal: within the past 12 months] (365 days)